Patients undergoing urologic surgery.

The above is a clinical trial inclusion criterion. Annotated with entity spans:
Patients undergoing [Procedure: urologic surgery].